Clinical trial inclusion criterion:
treatment-naive patients with B-cell lymphoma

Entity relations:
- Has_negation("treatment", "naive")